Clinical trial inclusion criterion:
Estimated creatinine clearance of at least 60 mL/min (using the Cockcroft-Gault equation) at screening only.

Entity relations:
- Has_value("Estimated creatinine clearance", "at least 60 mL/min")